下列何種酵素不會參與 DNA 複製（DNA replication）？
A. DNA 拓樸異構酶（DNA topoisomerase）
B. 解螺旋酶（helicase）
C. 單股 DNA 鍵結蛋白（single-stranded DNA binding protein）
D. 依賴 DNA 的 RNA 聚合酶（DNA-dependent RNA polymerase）

正確答案：D. 依賴 DNA 的 RNA 聚合酶（DNA-dependent RNA polymerase）